Clinical trial inclusion criterion:
Body mass index (BMI; weight [kilogram(kg)]/height^2 [meter square (m^2)]) between 18 and 30 kg/m^2, (inclusive)

Entity relations:
- Subsumes("Body mass index", "BMI")
- Subsumes("Body mass index", "weight [kilogram(kg)]/height^2 [meter square (m^2)]")
- Has_value("Body mass index", "between 18 and 30 kg/m^2")